Clinical trial inclusion criterion:
Medical history, if applicable (natural menopause at least 12 months prior to first study drug administration; or surgical menopause by bilateral ovariectomy at least 3 months prior to first study drug administration), in addition: in women < 65 years old, follicle stimulating hormone (FSH) > 40 IU/L

Entity relations:
- Has_index("at least 12 months prior to first study drug administration", "first study drug administration")
- AND("surgical menopause", "bilateral ovariectomy")
- Has_index("at least 3 months prior to first study drug administration", "first study drug administration")
- Has_temporal("surgical menopause", "at least 3 months prior to first study drug administration")
- Has_temporal("natural menopause", "at least 12 months prior to first study drug administration")
- Has_value("years old", "< 65 years")
- Has_value("follicle stimulating hormone (FSH)", "> 40 IU/L")
- AND("years old", "follicle stimulating hormone (FSH)")
- AND("women", "follicle stimulating hormone (FSH)")
- OR("natural menopause", "surgical menopause", "years old")